What is the use of MammaPrint and Oncotype DX?

The MammaPrint and Oncotype DX assays are used to predict breast cancer recurrence risk and guide adjuvant chemotherapy decisions.